Clinical trial inclusion criterion:
Unilateral leg pain secondary to lateral stenosis, disc protrusion or herniated disc.

Entity relations:
- AND("lateral stenosis", "Unilateral leg pain")
- OR("lateral stenosis", "disc protrusion", "herniated disc")